關於懷孕婦女的膀胱炎或急性腎盂腎炎的敘述，下列何者錯誤？
A. 因為尿滯留，使得泌尿道是懷孕婦女最常見的感染位置
B. 發生的單純膀胱炎（simple cystitis），給予單一劑量之抗生素，通常都可治療
C. 泌尿道感染的最常見致病菌與非懷孕期婦女相同，為Escherichia coli
D. 發生腎盂腎炎，由於產生合併症的機會大，通常須較非懷孕時予以更積極的治療

正確答案：B. 發生的單純膀胱炎（simple cystitis），給予單一劑量之抗生素，通常都可治療